在器官移植之後，下列那一種病毒最可能造成器官移植感染，且對於抗病毒藥物很容易產生抗藥性？
A. 腺病毒（Adenovirus）
B. 人類巨細胞病毒 （Cytomegalovirus）
C. B型肝炎病毒（Hepatitis B virus）
D. 冠狀病毒SARS CoV

正確答案：B. 人類巨細胞病毒 （Cytomegalovirus）